Clinical trial inclusion criteria:
Signed Informed Consent Form
Patients having physical and mental ability to participate in the study
Patients of both sexes aged 35 to 65 years
Presence of documented ST-elevation myocardial infarction confirmed by ECG, as well as troponin I and CK-MB levels.
Presence of hemodynamically relevant stenosis of one artery (i.e., the infarct-related artery) confirmed by coronary angiography (CAG), with the occlusion of other arteries not exceeding 30%.

Annotated entities:
- Post-eligibility: "Signed Informed Consent Form"
- Post-eligibility: "Patients having physical and mental ability to participate in the study"
- Person: "sexes"
- Value: "both"
- Person: "aged"
- Value: "35 to 65 years"
- Condition: "ST-elevation myocardial infarction"
- Procedure: "ECG"
- Measurement: "troponin I"
- Measurement: "CK-MB"
- Condition: "stenosis of artery"
- Multiplier: "one"
- Condition: "infarct-related artery"
- Qualifier: "hemodynamically relevant"
- Procedure: "coronary angiography"
- Procedure: "CAG"
- Condition: "occlusion of other arteries"
- Multiplier: "not exceeding 30%"